Motor complete tetraplegia for at least 3 months

The above is a clinical trial inclusion criterion. Annotated with entity spans:
Motor [Qualifier: complete] [Condition: tetraplegia] for [Temporal: at least 3 months]